Clinical trial inclusion criterion:
Evidence of Mycoplasma pneumoniae infection

Annotated entities:
- Condition: "Mycoplasma pneumoniae infection"